Clinical trial exclusion criterion:
Uncontrolled asthma;

Annotated entities:
- Condition: "asthma"
- Qualifier: "Uncontrolled"